Clinical trial inclusion criterion:
. Inclusion criteria are American Society of Anesthesiologists (ASA) physical status I-III, age between 18 and 70 years and body mass index (BMI) between 20 and 35 kg/m2.

Entity relations:
- Subsumes("American Society of Anesthesiologists physical status", "ASA")
- Has_value("American Society of Anesthesiologists physical status", "I-III")
- Has_value("age", "between 18 and 70 years")
- Subsumes("body mass index", "BMI")
- Has_value("body mass index", "between 20 and 35 kg/m2")